Austrian syndrome is a rare entity characterized by Osler's triad. Please list the 3 components of Osler's triad.

Austrian syndrome, which is also known as Osler's triad, is a rare aggressive pathology consisting of pneumonia, endocarditis, and meningitis caused by Streptococcus pneumoniae